History of cochlear implant

The above is a clinical trial exclusion criterion. Annotated with entity spans:
[Temporal: History] of [Device: cochlear implant]